Has a terminal illness with life expectancy < 12 months

The above is a clinical trial exclusion criterion. Annotated with entity spans:
Has a terminal illness with [Observation: life expectancy] [Value: < 12 months]